Known history of Type 2 diabetes mellitus for >3 months

The above is a clinical trial inclusion criterion. Annotated with entity spans:
Known history of [Condition: Type 2 diabetes mellitus] for [Value: >3 months]